下列何者為選擇性子宮頸縫合（elective cerclage placement）的適應症？
A. 有三次懷孕前期（first trimester）的自然流產病史
B. 有三次懷孕中期（second trimester）在無合併產痛，或胎盤剝離情形下的自然流產病史
C. 以前接受過子宮頸錐狀切片（loop electrosurgical excision procedure）治療
D. 妊娠 18 週時子宮頸長度為 35 mm

正確答案：B. 有三次懷孕中期（second trimester）在無合併產痛，或胎盤剝離情形下的自然流產病史